Which disease is caused by repeat expansion in VWA1?

An ancestral 10-bp repeat expansion in VWA1 causes recessive hereditary motor neuropathy.